關於冠狀動脈病之外科治療方式，下列何者之效果最差？
A. 以心臟麻痺液將心臟靜止後，再進行冠狀動脈繞道術（cardioplegic arrest coronary artery bypass
B. 不停跳冠狀動脈繞道術（off pump coronary artery bypass grafting）
C. 經心肌雷射血管再通術（transmyocardial laser revascularization）
D. 微創直接冠狀動脈繞道術（minimally invasive direct coronary artery bypass grafting）

正確答案：C. 經心肌雷射血管再通術（transmyocardial laser revascularization）